Mental , physical incapacity to fill in the questionnaires

The above is a clinical trial exclusion criterion. Annotated with entity spans:
[Condition: Mental] , [Condition: physical incapacity] to [Procedure: fill in the questionnaires]